Clinical trial inclusion criterion:
Subjects are allowed to have received, but are not required to have received:

Annotated entities:
- Parsing_Error: "Subjects are allowed to have received, but are not required to have received:"